你（妳）是位急診醫師，60 歲的李先生因近日逐漸惡化的呼吸困難至急診就醫，理學檢查發現血壓 138/80 mmHg，心跳 96/分，呼吸 20/分，未給予氧氣時的血氧濃度為 90%，頸靜脈怒張，有第三心音，在心尖有第三度的泛收縮期心雜音（grade III/VI pansystolic murmur over apex），雙側肺囉音 （crackles），及下肢水腫。關於李先生病情及處置下列何者錯誤？
A. 應為失代償心衰竭（decompensated heart failure），可能合併肺水腫（pulmonary edema）。初步處置為 LMNO，即利尿劑（loop diuretics: furosemide），硝化甘油（nitroglycerin），氧氣。Morphine 可視情況給予
B. 應探尋心衰竭病因及其惡化因子：如病史詢問（過去病史，藥物順從性，飲食，感染...），做心電圖（心肌缺氧或心律不整），測心肌酵素（心肌梗塞），心臟超音波（瓣膜性心臟病），測 CBC
C. 可開始使用 ACEI（Angiotensin-converting enzyme inhibitor），或 ARB（Angiotensin II receptor blocker）
D. 儘快開始使用乙型交感神經阻斷劑（β-blocker）

正確答案：D. 儘快開始使用乙型交感神經阻斷劑（β-blocker）